Clinical trial inclusion criterion:
Patient >18 years of age

Entity relations:
- Has_value("age", ">18 years")